Clinical trial exclusion criterion:
Chronic diseases requiring immune agents or hormone therapy

Annotated entities:
- Condition: "Chronic diseases"
- Drug: "immune agents"
- Procedure: "hormone therapy"